Provide written informed consent prior to inclusion.

The above is a clinical trial inclusion criterion. Annotated with entity spans:
Provide [Observation: written informed consent] [Temporal: prior to inclusion].